Clinical trial exclusion criterion:
Pregnancy or women with potential childbearing

Annotated entities:
- Pregnancy_considerations: "Pregnancy or women with potential childbearing"